Clinical trial inclusion criterion:
Antiviral experienced,

Entity relations:
- Has_mood("Antiviral", "experienced")
- multi("experienced", "experienced")